在施行手術性子宮鏡時，下列何種方式能減少子宮擴張液（distension media）進入全身血液循環所引起之合併症？
A. 經常且正確的計算出液體輸入與輸出子宮腔的總量
B. 維持子宮腔壓力高於平均動脈壓
C. 使用幫浦加壓幫助液體撐起子宮腔
D. 利用抽吸管收集輸出的液體

正確答案：A. 經常且正確的計算出液體輸入與輸出子宮腔的總量